¿Cuál de las benzodiazepinas reseñadas es la más utilizada en el tratamiento de la epilepsia?:
1. Alprazolam.
2. Bromazepam.
3. Clonazepam.
4. Lorazepam.

Respuesta correcta: 3. Clonazepam.